Patients with a histologically, radiologically or haematologically confirmed malignancy whose pain is judged by the investigator to be caused by the malignancy

The above is a clinical trial inclusion criterion. Annotated with entity spans:
Patients with a [Procedure: histologically], [Procedure: radiologically] or [Procedure: haematologically] [Value: confirmed] [Condition: malignancy] whose [Condition: pain] is judged by the investigator to be caused by the malignancy